Clinical trial exclusion criterion:
4. Known left-sided endocarditis or prosthetic heart valve.

Annotated entities:
- Condition: "left-sided endocarditis"
- Qualifier: "left-sided"
- Device: "prosthetic heart valve"